Clinical trial exclusion criterion:
Current severe heart failure (New York Heart Association class IV). Subjects will also be excluded if they have a known ejection fraction of <30% or if they have an implantable cardioverter defibrillator (ICD).

Annotated entities:
- Condition: "heart failure"
- Qualifier: "severe"
- Measurement: "New York Heart Association"
- Value: "class IV"
- Measurement: "ejection fraction"
- Value: "<30%"
- Device: "implantable cardioverter defibrillator (ICD)"